Clinical trial exclusion criterion:
Subject has sustained pathologic fractures of the vertebra or multiple fractures of the vertebra or hip.

Annotated entities:
- Condition: "fractures of the vertebra"
- Multiplier: "multiple"
- Condition: "fractures of the vertebra"
- Condition: "fractures of the hip"
- Qualifier: "pathologic"